下列何結構不具有穩固腎臟的作用？
A. 圍腎脂肪（perirenal fat）
B. 腎肌膜（renal fascia）
C. 腎動、靜脈
D. 腎上腺

正確答案：D. 腎上腺